What is the difference between ganglion mother cells (GMC) and intermediate neural precursor cells (INP) in Drosophila?

GMC divides only once to give rise to two post-mitotic cells (neurons or glia), whereas the INP can also self-renew, albeit for fewer rounds than a NSC, and generate GMCs